Clinical trial exclusion criterion:
HIV infection

Annotated entities:
- Condition: "HIV infection"